Clinical trial exclusion criterion:
Porphyria reported by patient

Annotated entities:
- Condition: "Porphyria"